Clinical trial inclusion criterion:
Clinical Administered PTSD Scale 5 Monthly version Criteria A and >30 points

Entity relations:
- Has_value("Clinical Administered PTSD Scale", ">30 points")
- Has_value("Clinical Administered PTSD Scale", "Criteria A")